Clinical trial inclusion criterion:
Patient has experienced lower urinary tract symptoms (LUTS) for at least 6 months prior to study enrollment

Annotated entities:
- Condition: "lower urinary tract symptoms (LUTS)"
- Temporal: "at least 6 months prior to study enrollment"
- Reference_point: "study enrollment"